一位30歲女性病人尿液分析發現血尿，下列何項檢查結果支持是腎小球性（glomerular）血尿？
A. 尿沉渣看見顆粒性圓柱體
B. 24小時蛋白尿排泄量> 2.5克
C. 尿沉渣發現變形性紅血球
D. 紅血球數目> 50顆⁄高倍視野

正確答案：C. 尿沉渣發現變形性紅血球